What is the mechanism of action of arimoclomol?

Arimoclomol is a heat shock protein co-inducer that promotes nascent protein folding. It enhances the ability of differentiated neurons to survive heat shock.